Clinical trial inclusion criterion:
CrCl = 60 ml/min

Entity relations:
- Has_value("CrCl", "= 60 ml/min")